Patients with allergies or contraindications to study medications

The above is a clinical trial exclusion criterion. Annotated with entity spans:
Patients with [Condition: allergies] or [Condition: contraindications] to [Drug: study medications]